Clinical trial inclusion criterion:
Subject has curettage for retained product after second trimester abortion

Entity relations:
- Has_qualifier("abortion", "second trimester")
- AND("curettage", "retained product")
- AND("retained product", "abortion")